26歲男性因體重120公斤至減重中心求診，他身高172公分，下列關於減重手術的說明何者錯誤？
A. 限制型術式（restrictive procedures）減重效果較吸收不良型術式（malabsorptive procedures）低
B. 限制型術式（restrictive procedures）的術後併發症及死亡率較吸收不良型術式（malabsorptive procedures）低
C. 吸收不良型術式（malabsorptive procedures）手術後，術前合併症 （comorbidity）的治癒率較限制型術式（restrictive procedures）高
D. 限制型術式（restrictive procedures）的手術適應症body mass index值較吸收不良型術式（malabsorptive procedures）低

正確答案：D. 限制型術式（restrictive procedures）的手術適應症body mass index值較吸收不良型術式（malabsorptive procedures）低